Clinical trial inclusion criteria:
Patients age 8- 18 years 2) Patients undergoing minimally invasive pectus excavatum repair via Nuss procedure 3) American Society of Anesthesiology Status I-III

Annotated entities:
- Person: "age"
- Value: "8- 18 years"
- Line: "2) Patients undergoing minimally invasive pectus excavatum repair via Nuss procedure"
- Line: "3) American Society of Anesthesiology Status I-III"
- Procedure: "minimally invasive pectus excavatum repair"
- Qualifier: "Nuss procedure"
- Measurement: "American Society of Anesthesiology Status"
- Value: "I-III"